Must have failed after fluoropyrimidine-, oxaliplatin-, and irinotecan-containing chemotherapy regimens for metastatic disease. Failure is defined as either disease progression (clinical or radiological) or intolerance to the regimen. Metastatic relapse within 6 months after completing adjuvant chemotherapy (with either an irinotecan or oxaliplatin containing regimen) will also be considered as treatment failure of a prior regimen for metastatic disease. Laboratory: Adequate baseline organ function defined by (<=7 days prior to first dose of study treatment).

The above is a clinical trial inclusion criterion. Annotated with entity spans:
Must have [Qualifier: failed] after [Procedure: fluoropyrimidine-], [Procedure: oxaliplatin-], and [Procedure: irinotecan-containing chemotherapy] regimens for [Condition: metastatic disease]. Failure is defined as either [Condition: disease progression] (clinical or radiological) or [Condition: intolerance] to [Procedure: the regimen]. [Condition: Metastatic relapse] [Temporal: within 6 months after completing adjuvant chemotherapy] (with either an [Procedure: irinotecan] or [Procedure: oxaliplatin containing regimen]) will also be considered as treatment failure of a prior regimen for metastatic disease. Laboratory: [Condition: Adequate baseline organ function] defined by ([Temporal: <=7 days prior to first dose of study treatment]).